Clinical trial exclusion criterion:
Unable to perform questionnaire

Annotated entities:
- Observation: "Unable to perform questionnaire"